List genes that have been found mutated in CMT1A (Charcot-Marie-Tooth disease type 1 A).

PMP22 is the common gene found mutated through a duplication in CMT1A. Other genes are
MPZ and SH3TC2